下列有關第二型水通道蛋白（aquaporin 2）之敘述，何者正確？
A. 其轉位至細胞膜之現象是受血管加壓素(vasopressin)所調控
B. 主要存在於亨利氏環下降枝（descending limb of loop of Henle）
C. 協助水分子由高張（hypertonic）向低張（hypotonic）處移動
D. 負責進行水分的主動運輸（active transport）

正確答案：A. 其轉位至細胞膜之現象是受血管加壓素(vasopressin)所調控